What is the most common histological diagnosis of "butterfly glioma"?

Butterfly glioma is glioblastoma multiforme invading corpus callosum .